La miosina:
1. Está formada por cuatro hélices alfa.
2. Tiene una estructura ovoide.
3. Es la principal proteína de los filamentos gruesos de las miofibrillas musculares.
4. Es la proteína más abundante del organismo.

Respuesta correcta: 3. Es la principal proteína de los filamentos gruesos de las miofibrillas musculares.